Son zoonóticos los:
1. Rotavirus.
2. Paramixovirus.
3. Citomegalovirus.
4. Arenavirus.
5. Parvovirus.

Respuesta correcta: 4. Arenavirus.